Clinical trial inclusion criterion:
Power Doppler score of >=10

Entity relations:
- Has_value("Power Doppler score", ">=10")